Platelet count <100,000/mm3

The above is a clinical trial exclusion criterion. Annotated with entity spans:
[Measurement: Platelet count] [Value: <100,000/mm3]